Clinical trial exclusion criterion:
Neutrophil count < 0.5 x 109 cells/L.

Entity relations:
- Has_value("Neutrophil count", "< 0.5 x 109 cells/L")